Clinical trial exclusion criterion:
Contraindications to empagliflozin, Sitagliptin

Entity relations:
- AND("Contraindications", "empagliflozin")
- OR("empagliflozin", "Sitagliptin")